What is the human RCA locus size in bps?

The locus containing the ribosomal protein A (RCA) gene is located at a perinuclear structure 3 kb from the left end and 610 kb in bps, leaving a footprint of 7.4 kb on chromosome 1.